How does parathyroid hormone affect circulating levels of periostin?

Parathyroid hormone can upregulate periostin levels.